下列有關何杰金氏症（Hodgkin's disease）之敘述，何者錯誤？
A. 病變部位主要為 axial involvement
B. 在青春期（adolescence）有一出現高峰
C. 發生頻率較 non-Hodgkin's lymphoma 高
D. 大部分 stageⅠ－Ⅱ，放射治療（R/T）是可痊癒的

正確答案：C. 發生頻率較 non-Hodgkin's lymphoma 高